Clinical trial inclusion criterion:
asthma or COPD

Annotated entities:
- Condition: "asthma"
- Condition: "COPD"